Clinical trial exclusion criterion:
Unstable cardiac disease despite treatment, myocardial infarction within 6 months prior to study entry

Annotated entities:
- Condition: "Unstable cardiac disease"
- Procedure: "treatment"
- Condition: "myocardial infarction"
- Temporal: "within 6 months prior to study entry"